Clinical trial inclusion criterion:
In sustained clinical remission for the last 6 months while receiving treatment with either etanercept, infliximab, or adalimumab, and greater than or equal to 1 DMARD (methotrexate, hydroxychloroquine, sulfasalazine, leflunomide, minocycline, cyclosporine, azathioprine, gold, penicillamine). DAS28 should be less than 2.6 on each visit over the preceding 6 months, with at least one visit 2-4 months before enrollment. If there is no visit 6 months before enrollment, the nearest visit in the 6-12 month period before enrollment should be considered and have a DAS28 less than 2.6.

Entity relations:
- Has_multiplier("sustained clinical remission", "for the last 6 months")
- Has_multiplier("DMARD", "greater than or equal to 1")
- Subsumes("DMARD", "methotrexate")
- Has_value("DAS28", "less than 2.6")
- multi("on each visit", "visit")
- Has_multiplier("visit", "at least one")
- Has_temporal("visit", "2-4 months before enrollment")
- Has_multiplier("DAS28", "on each visit")
- Has_multiplier("DAS28", "over the preceding 6 months")
- OR("etanercept", "infliximab", "adalimumab")
- OR("methotrexate", "gold", "azathioprine", "cyclosporine", "minocycline", "leflunomide", "sulfasalazine", "hydroxychloroquine", "penicillamine")